Basal follicle-stimulating hormone (FSH) <=12 International unit per liter (IU/L)

The above is a clinical trial inclusion criterion. Annotated with entity spans:
[Measurement: Basal follicle-stimulating hormone (FSH)] [Value: <=12 International unit per liter (IU/L)]